List the two most important synaptic markers.

Synaptic markers include acetylcholine, gamma-aminobutyric acid (GABA), glutamine, glycine and synaptophysin.